active opportunistic infection or significant co-morbidities

The above is a clinical trial exclusion criterion. Annotated with entity spans:
active [Condition: opportunistic infection] or [Qualifier: significant] [Condition: co-morbidities]